Having been diagnosed with primary OCD as defined by the Diagnostic and Statistical Manual of Mental Disorders (DSM-IV-) criteria;Cleaning or checking as primary OCD symptoms

The above is a clinical trial inclusion criterion. Annotated with entity spans:
Having been diagnosed with [Condition: primary OCD] as defined by the [Measurement: Diagnostic and Statistical Manual of Mental Disorders] ([Measurement: DSM-IV]-) criteria;Cleaning or checking as primary OCD symptoms